關於異位性皮膚炎（atopic dermatitis）的敘述，何者錯誤？
A. 皮膚的屏障功能（skin barrier function）會降低
B. 在成人的病灶好發於四肢伸側（extensor）部位
C. 患者易伴隨金黃色葡萄球菌皮膚感染
D. 大部分患者血清 IgE 值升高

正確答案：B. 在成人的病灶好發於四肢伸側（extensor）部位